Which is the most common type of pediatric cerebellar tumor?

Medulloblastoma is a malignant cerebellar tumor seen primarily in the pediatric age group that has a known ability to metastasize extraneurally